IBS subtype with constipation

The above is a clinical trial exclusion criterion. Annotated with entity spans:
[Condition: IBS subtype] with [Condition: constipation]